Patients with past treatment failures of aripiprazole

The above is a clinical trial exclusion criterion. Annotated with entity spans:
Patients with past [Observation: treatment failures] of [Drug: aripiprazole]